Clinical trial inclusion criterion:
Intact fetal membranes

Entity relations:
- Has_qualifier("fetal membranes", "Intact")